Clinical trial exclusion criterion:
Liver disease or elevated liver enzymes

Annotated entities:
- Condition: "Liver disease"
- Condition: "elevated liver enzymes"
- Measurement: "liver enzymes"
- Value: "elevated"